Ante un paciente de 60 años de edad, diabético, con angina estable secundaria a cardiopatía isquémica por obstrucción subtotal en el tercio medio de la arteria coronaria descendente anterior, ¿qué tratamiento propondría?
1. Médico con vasodilatadores y betabloqueantes para evitar la angina.
2. Expectante con reposo riguroso ya que al disminuir la demanda miocárdica de oxígeno deberá disminuir la angina.
3. Quirúrgico para revascularizar el miocardio isquémico mediante un puente (by-pass) de arteria mamaria izquierda distal a la lesión en la arteria coronaria enferma.
4. Dilatación de la lesión en la arteria coronaria mediante un cateterismo terapéutico.
5. Cateterismo terapéutico para dilatar la lesión de la arteria enferma e implantación de un "stent" en la zona dilatada.

Respuesta correcta: 5. Cateterismo terapéutico para dilatar la lesión de la arteria enferma e implantación de un "stent" en la zona dilatada.